關於 methadone 的敘述，下列何者錯誤？
A. 止痛的效果較 morphine 差
B. 作用的半衰期較 morphine 長
C. 口服有效
D. 所產生的戒斷作用較 morphine 輕微

正確答案：A. 止痛的效果較 morphine 差